Clinical trial exclusion criterion:
Kidney, parathyroid, congenital bone metabolic disease

Entity relations:
- Has_qualifier("disease", "Kidney")
- OR("Kidney", "parathyroid", "congenital", "bone", "metabolic")